病患數天無法經口進食，通常靜脈點滴中會提供每日約 100 公克葡萄糖，以避免下列何種現象，而造成肌肉流失（muscle wasting）？
A. 因為缺少能源，肌肉細胞壞死
B. 因為發生肌肉內肝糖分解（glycogenolysis）以提供葡萄糖來供給能源
C. 因為肌肉內發生脂肪分解（lipolysis），以提供脂肪酸來供給能源
D. 因為肌肉內發生蛋白質分解，以合成葡萄糖來提供能源

正確答案：D. 因為肌肉內發生蛋白質分解，以合成葡萄糖來提供能源